undergoing elective posterior spine multi-level instrumentation surgery

The above is a clinical trial inclusion criterion. Annotated with entity spans:
[Temporal: undergoing] [Qualifier: elective] [Qualifier: posterior spine] [Procedure: multi-level instrumentation surgery]